Clinical trial exclusion criterion:
any immunosuppressive treatment, such as systemic corticosteroids

Entity relations:
- Subsumes("immunosuppressive treatment", "systemic corticosteroids")